Clinical trial inclusion criterion:
History of a liver biopsy showing cirrhosis (e.g. Metavir score = 4 or Ishak score > 5)

Entity relations:
- Has_value("Metavir score", "= 4")
- Has_value("Ishak score", "> 5")
- Subsumes("cirrhosis", "Metavir score")
- AND("liver biopsy", "cirrhosis")
- OR("Metavir score", "Ishak score")